那一種抗心律不整藥物最常有臉紅、胸悶及呼吸急迫之副作用？
A. Propafenone
B. Adenosine
C. Procainamide
D. Atenolol

正確答案：B. Adenosine